The patient has bony lesions as the sole evaluable disease.

The above is a clinical trial exclusion criterion. Annotated with entity spans:
The patient has [Condition: bony lesions] as [Value: the sole] [Qualifier: evaluable disease].